Clinical trial exclusion criterion:
History of ischemic heart disease or peripheral arterial disease or cerebrovascular disease

Entity relations:
- OR("ischemic heart disease", "peripheral arterial disease", "cerebrovascular disease")